Child unwilling to agree to second insulin injection at a meal-time

The above is a clinical trial exclusion criterion. Annotated with entity spans:
[Post-eligibility: Child unwilling to agree to second insulin injection at a meal-time]